Clinical trial exclusion criterion:
Patients who already received oral vancomycin or metronidazole (either oral or intravenous) for > 24 hours within the preceding 72 hours at the time of enrollment.

Entity relations:
- Has_qualifier("vancomycin", "oral")
- Has_index("preceding 72 hours at the time of enrollment.", "enrollment")
- Has_multiplier("vancomycin", "> 24 hours")
- OR("vancomycin", "metronidazole")